Clinical trial exclusion criterion:
Concurrent use of organic nitrites and nitrates.

Annotated entities:
- Temporal: "Concurrent"
- Drug: "organic nitrites"
- Drug: "nitrates"